Clinical trial exclusion criterion:
Allergy to tested material

Entity relations:
- AND("Allergy", "tested material")